Clinical trial inclusion criterion:
Physician diagnosis of chronic heart failure, American Heart Association Stage C-D

Entity relations:
- AND("chronic heart failure", "American Heart Association Stage")
- Has_value("American Heart Association Stage", "C-D")